Clinical trial inclusion criterion:
2. Pulmonary venous hypertension (measured as pulmonary capillary wedge pressure (PCWP) ≤15 mmHg. If PCWP is not available, then mean left atrial pressure or left ventricular end-diastolic pressure ≤15 mmHg in the absence of left atrial obstruction. and

Entity relations:
- Has_value("pulmonary capillary wedge pressure (PCWP)", "≤15 mmHg")
- AND("Pulmonary venous hypertension", "pulmonary capillary wedge pressure (PCWP)")
- Has_value("left ventricular end-diastolic pressure", "≤15 mmHg")
- Has_value("mean left atrial pressure", "≤15 mmHg")
- Has_negation("left atrial obstruction", "absence")
- OR("mean left atrial pressure", "left ventricular end-diastolic pressure")